外膝狀體核未接受下列何者投射的神經纖維？
A. 上丘（superior colliculus）
B. 藍斑核（locus coeruleus）
C. 背側縫核（dorsal raphe nucleus）
D. 視覺皮質第 18 區（visual cortex, area 18）

正確答案：D. 視覺皮質第 18 區（visual cortex, area 18）